Clinical trial exclusion criterion:
Upper gastrointestinal surgery history

Annotated entities:
- Procedure: "Upper gastrointestinal surgery"
- Temporal: "history"